Clinical trial exclusion criteria:
Patients having had an ophthalmic surgical procedure within 6 months of the beginning of the study.
Patients with a diagnosis of glaucoma
Any abnormality of the cornea which may prevent reliable applanation tonometry
Known allergy/ hypersensitivity reaction to Brimonidine
Contra-indication to Brimonidine including patients on monoamine oxidase inhibitors (MOA)
Patients unwilling or unable to provide informed consent
Patients with anticipated difficult airway management (as this may require medications and/or airway manipulations resulting in increased IOP)

Annotated entities:
- Procedure: "ophthalmic surgical procedure"
- Temporal: "within 6 months of the beginning of the study"
- Reference_point: "study"
- Condition: "glaucoma"
- Condition: "abnormality"
- Qualifier: "cornea"
- Condition: "allergy"
- Condition: "hypersensitivity"
- Drug: "Brimonidine"
- Condition: "Contra-indication"
- Drug: "Brimonidine"
- Drug: "monoamine oxidase inhibitors"
- Drug: "MOA"
- Informed_consent: "Patients unwilling or unable to provide informed consen"
- Observation: "difficult airway management"